use of illicit drugs

The above is a clinical trial exclusion criterion. Annotated with entity spans:
use of [Drug: illicit drugs]